Clinical trial exclusion criteria:
age <18 years;
Pregnancy
inability to give informed written consent;
previous thoracic surgery or thrombolytic therapy for pleural infection;
medical thoracoscopy cannot be performed within 48 hours;
inability to tolerate procedure due to hemodynamic instability or severe hypoxemia;
inability to correct coagulopathy;
presence of a homogeneously echogenic effusion on pleural US27 -

Annotated entities:
- Person: "age"
- Value: "<18 years"
- Condition: "Pregnancy"
- Informed_consent: "inability to give informed written consent;"
- Procedure: "thoracic surgery"
- Procedure: "thrombolytic therapy"
- Condition: "pleural infection"
- Temporal: "previous"
- Procedure: "medical thoracoscopy"
- Mood: "cannot be performed"
- Temporal: "within 48 hours"
- Negation: "cannot"
- Condition: "inability to tolerate"
- Procedure: "procedure"
- Condition: "hemodynamic instability"
- Condition: "hypoxemia"
- Qualifier: "severe"
- Condition: "coagulopathy"
- Procedure: "correct"
- Mood: "inability to"
- Condition: "homogeneously echogenic effusion"
- Procedure: "pleural US"